Neisseria meningitidis es:
1. Un bacilo gram-negativo.
2. Normalmente resistente a los antibióticos beta-lactámicos.
3. Un coco anaerobio.
4. Un diplococo capsulado.
5. Móvil por flagelación peritrica.

Respuesta correcta: 4. Un diplococo capsulado.